With acute myocardial infarction with ST segment elevation in the first 12 hours from the onset of symptoms.

The above is a clinical trial exclusion criterion. Annotated with entity spans:
With [Condition: acute myocardial infarction] with [Condition: ST segment elevation] [Temporal: in the first 12 hours from the onset of symptoms].